What are the advantages of the top down mass spectrometric analysis of histones?

Top down mass spectrometry is a way to analyze intact proteins thus enabling: isoform characteriztion and analysis of post-translational modifications.